Clinical trial inclusion criterion:
Have normal screening laboratories for white blood cells (WBC), hemoglobin (Hgb), platelets, sodium, potassium, chloride, bicarbonate, blood urea nitrogen (BUN), creatinine, ALT (liver function), AST (liver function) and bilirubin

Entity relations:
- Subsumes("white blood cells", "WBC")
- Subsumes("hemoglobin", "Hgb")
- Subsumes("blood urea nitrogen", "BUN")
- Has_value("white blood cells", "normal")
- Has_value("hemoglobin", "normal")
- Has_value("platelets", "normal")
- Has_value("sodium", "normal")
- Has_value("potassium", "normal")
- Has_value("chloride", "normal")
- Has_value("bicarbonate", "normal")
- Has_value("blood urea nitrogen", "normal")
- Has_value("creatinine", "normal")
- Has_value("ALT", "normal")
- Has_value("AST", "normal")
- Has_value("bilirubin", "normal")